Clinical trial exclusion criteria:
Presence of a significant medical or psychiatric condition (Examples include: Diagnosis and treatment of tuberculosis (TB) or HIV; renal insufficiency; hepatic disease; oral or parenteral medication known to affect the immune function, such as corticosteroids, other immunosuppressant drugs; or behavioural or memory issues)
Ever having received oral cholera vaccine.
Receipt of an investigational product (within 30 days before vaccination).
History of diarrhoea in 7 days prior to first dose of vaccine (defined as =3 unformed loose stools in 24 hours).
History of chronic diarrhea (lasting for more than 2 weeks in the past 6 months)
Current use of laxatives, antacids, or other agents to lower stomach acidity?
Planning to become pregnant in the next 2 years.

Annotated entities:
- Condition: "psychiatric condition"
- Condition: "medical condition"
- Qualifier: "significant"
- Condition: "tuberculosis (TB)"
- Condition: "HIV"
- Procedure: "treatment"
- Condition: "renal insufficiency"
- Condition: "hepatic disease"
- Drug: "parenteral medication"
- Drug: "oral medication"
- Qualifier: "known to affect the immune function"
- Drug: "corticosteroids"
- Drug: "immunosuppressant drugs"
- Qualifier: "other"
- Condition: "behavioural issues"
- Condition: "memory issues"
- Drug: "oral cholera vaccine"
- Competing_trial: "Receipt of an investigational product (within 30 days before vaccination)."
- Condition: "diarrhoea"
- Temporal: "in 7 days prior to first dose of vaccine"
- Reference_point: "first dose of vaccine"
- Value: "=3"
- Measurement: "unformed loose stools in 24 hours"
- Temporal: "History"
- Condition: "chronic diarrhea"
- Temporal: "History"
- Multiplier: "lasting for more than 2 weeks"
- Temporal: "in the past 6 months"
- Drug: "laxatives"
- Drug: "antacids"
- Drug: "agents to lower stomach acidity"
- Qualifier: "other"
- Pregnancy_considerations: "Planning to become pregnant in the next 2 years."